Clinical trial exclusion criterion:
Insulin treated diabetes

Annotated entities:
- Qualifier: "Insulin treated"
- Condition: "diabetes"
- Drug: "Insulin"